What are the effects of CAMK4 inhibition?

CaMK4 inhibition has potential as a therapeutic strategy for Th17-driven autoimmune diseases.